a-D-mannose intake within the last month

The above is a clinical trial exclusion criterion. Annotated with entity spans:
[Drug: a-D-mannose] intake [Temporal: within the last month]